Clinical trial inclusion criterion:
Age 19 and more

Entity relations:
- Has_value("Age", "19 and more")